With multiple sclerosis or other progressive neurological disease

The above is a clinical trial exclusion criterion. Annotated with entity spans:
With [Condition: multiple sclerosis] or other [Condition: progressive neurological disease]